Clinical trial inclusion criteria:
Pregnant women with APS diagnosed according to the revised classification criteria for APS in 2006 in Sydney, Australia
Early pregnancy body weight is 50-90 Kg

Annotated entities:
- Condition: "Pregnant"
- Person: "women"
- Condition: "APS"
- Qualifier: "revised classification criteria for APS in 2006 in Sydney, Australia"
- Temporal: "Early pregnancy"
- Measurement: "body weight"
- Value: "50-90 Kg"